Clinical trial exclusion criterion:
Inclusion in another study in the last 2 months.

Entity relations:
- Has_temporal("Inclusion in another study", "in the last 2 months")